Clinical trial inclusion criterion:
Has a cataract and is expected to undergo clear corneal cataract surgery with phacoemulsification and implantation of a posterior chamber intraocular lens

Entity relations:
- Has_qualifier("clear corneal cataract surgery", "with phacoemulsification")
- Has_qualifier("clear corneal cataract surgery", "implantation of a posterior chamber intraocular lens")